Clinical trial exclusion criterion:
Students and staff from USC Ostrow school of Dentistry will not be recruited for this study

Annotated entities:
- Non-query-able: "Students and staff from USC Ostrow school of Dentistry will not be recruited for this study"